Significant change in diet or level of physical activity within 1 month before dosing or change in weight of more than 5 kg within 3 months before Screening

The above is a clinical trial exclusion criterion. Annotated with entity spans:
[Qualifier: Significant] [Observation: change in diet] or level of physical activity [Temporal: within 1 month before dosing] or [Observation: change in weight] of [Value: more than 5 kg] [Temporal: within 3 months before Screening]